Clinical trial inclusion criterion:
without evidence of distant metastases.

Entity relations:
- Has_negation("distant metastases", "without")
- Has_mood("distant metastases", "evidence")